一位12歲男童因發燒住院，抽血發現血清肌酸酐（serum creatinine）值為3.3 mg/dL，24小時之尿液肌酸酐值為 76 mg/dL，24 小時尿液總量為 900 mL。請利用男童之肌酸酐廓清率（creatinine clearance; CCr）來估算男童之腎絲球過濾率（glomerular filtration rate; GFR），並指出下列那一個數值最接近男童真正的腎絲球過濾率？（男童體表面積（body surface area）值為1.32 m2）
A. 10-20 mL/min/1.73 m2
B. 20-30 mL/min/1.73 m2
C. 30-40 mL/min/1.73 m2
D. 40-50 mL/min/1.73 m2

正確答案：A. 10-20 mL/min/1.73 m2